Clinical trial exclusion criterion:
Be allergic to amikacin

Entity relations:
- AND("allergic", "amikacin")